Clinical trial exclusion criterion:
Septic or hypovolemic shock

Annotated entities:
- Condition: "Septic shock"
- Condition: "hypovolemic shock"